Las células ciliadas de los canales semicirculares:
1. Detectan aceleración lineal.
2. Se despolarizan por entrada de K+ desde la endolinfa.
3. Poseen otolitos en su superficie.
4. Orientan sus estereocilios perpendicularmente a la estriola.

Respuesta correcta: 2. Se despolarizan por entrada de K+ desde la endolinfa.